Clinical trial exclusion criterion:
d. Positive HIV, Hepatitis B, or Hepatitis C test. e. Renal disease or renal dysfunction (as suggested by serum creatinine levels greater than or equal to 1.5 mg/dL (for males) and greater than or equal to 1.4 mg/dL (for females) or abnormal creatinine clearance).

Annotated entities:
- Measurement: "HIV test"
- Measurement: "Hepatitis B test"
- Measurement: "Hepatitis C test"
- Value: "Positive"
- Parsing_Error: "d."
- Parsing_Error: "e."
- Condition: "Renal disease"
- Condition: "renal dysfunction"
- Measurement: "serum creatinine levels"
- Value: "greater than or equal to 1.5 mg/dL"
- Person: "males"
- Person: "females"
- Value: "greater than or equal to 1.4 mg/dL"
- Condition: "abnormal creatinine clearance"